Clinical trial inclusion criterion:
2. Diagnosis: Diagnosis of spastic CP confirmed by a pediatric neurologist or pediatric rehabilitation specialist.

Annotated entities:
- Parsing_Error: "2."
- Condition: "spastic CP"